一位 20 天大女嬰，因新生兒篩檢 TSH 值為 30 μU/mL 而就診，下列那一項檢查對確診的助益最少？
A. 血清T4值
B. 血清free T4值
C. 血清T3值
D. 血清甲狀腺球蛋白值

正確答案：C. 血清T3值